Male and female individuals between ages of 18 to 70 years old

The above is a clinical trial inclusion criterion. Annotated with entity spans:
Male and female individuals [Value: between] [Person: ages] of 18 to 70 years old